Clinical trial inclusion criterion:
Male or female >= 18 years of age

Entity relations:
- Has_value("age", ">= 18 years")
- OR("Male", "female")